幼兒先天性的腮裂瘻管最常發生於第幾對腮裂？
A. 一
B. 二
C. 三
D. 四

正確答案：B. 二